Clinical trial inclusion criterion:
Patient on hemodialysis treatment for at least 1 month

Annotated entities:
- Procedure: "hemodialysis"
- Temporal: "at least 1 month"